Clinical trial exclusion criterion:
Patients who had received surgical periodontal treatment within the past 12 months

Annotated entities:
- Procedure: "surgical periodontal treatment"
- Temporal: "within the past 12 months"